青光眼之降壓藥物中，毛果芸香（pilocarpine）是屬於那一種藥劑？
A. 擬副交感神經劑（parasympathomimetics）
B. 抑副交感神經劑（parasympatholytics）
C. 抑交感神經劑（sympatholytics）
D. 碳酸酐酶抑制劑（carbonic anhydrase inhibitor）

正確答案：A. 擬副交感神經劑（parasympathomimetics）